下列有關骨骼肌與平滑肌的異同之敘述，何者正確？
A. 骨骼肌細胞actin固定在Z lines，而平滑肌細胞則固定在dense bodies
B. 骨骼肌細胞具有較多的actin，而平滑肌細胞具有較多的myosin
C. 骨骼肌細胞和平滑肌細胞皆具有troponin C
D. 骨骼肌細胞具有 tropomyosin 而平滑肌細胞則無

正確答案：A. 骨骼肌細胞actin固定在Z lines，而平滑肌細胞則固定在dense bodies